Clinical trial exclusion criterion:
Current or recent (last 60 days) tobacco or nicotine use

Annotated entities:
- Observation: "tobacco use"
- Observation: "nicotine use"
- Temporal: "last 60 days"